下列那一項不是世界衛生組織所提出的健康城市的健康指標？
A. 低出生體重比率
B. 嬰兒死亡率
C. 墮胎率（相對於每一個活產數）
D. 總死亡率

正確答案：C. 墮胎率（相對於每一個活產數）